subjects who sign the informed consent document

The above is a clinical trial inclusion criterion. Annotated with entity spans:
subjects who [Observation: sign the informed consent] document